Referred for STEMI within 6 hours from beginning of chest pain or stable coronary artery disease requiring a loading dose of Prasugrel or Ticagrelor according to the international recommendations.

The above is a clinical trial inclusion criterion. Annotated with entity spans:
Referred for [Condition: STEMI] [Temporal: within 6 hours from beginning of chest pain] or [Qualifier: stable] [Condition: coronary artery disease] requiring a [Multiplier: loading dose] of [Drug: Prasugrel] or [Drug: Ticagrelor] according to the international recommendations.